有關鴉片類物質藥理作用之敘述，下列何者錯誤？
A. 鴉片類物質可以通透胎盤影響子代
B. 鴉片類物質具有活化化學受體激發區（Chemoreceptor trigger zone）的作用
C. 鴉片類物質具有促進膀胱平滑肌收縮的作用
D. 鴉片類物質可以增加腸胃道的蠕動

正確答案：D. 鴉片類物質可以增加腸胃道的蠕動